下列有關肌肉病變之敘述，何者錯誤？
A. 血中肌酸激酶（creatine kinase）值有助於肌肉疾病的診斷
B. 裘馨氏肌肉失養症（Duchenne muscular dystrophy）是由肢體末端開始無力之肌肉疾病
C. 肌肉切片檢查有助於多發性肌炎之診斷
D. 肌強直性失養症（myotonic dystrophy）是成人常見之遺傳性肌肉疾病

正確答案：B. 裘馨氏肌肉失養症（Duchenne muscular dystrophy）是由肢體末端開始無力之肌肉疾病